Blood pressure greater than 140/90 and/or a pulse rate greater than 90 bpm

The above is a clinical trial exclusion criterion. Annotated with entity spans:
[Measurement: Blood pressure] [Value: greater than 140/90] and/or a [Measurement: pulse rate] [Value: greater than 90 bpm]